陳先生，58 歲，糖尿病十多年，平常不定期服用口服降血糖藥，沒有定期檢測血糖之習慣，右腳大足趾及第二足趾 4 週前外傷後，傷口潰爛，骨頭外露有膿液滲出，但陳先生卻表示沒有疼痛的感覺，皮膚乾、多皮屑，且足部冰冷，足背及內踝處脈搏摸不到，以陳先生之現有症狀來推測，下列何者診斷最不適用？
A. 周邊血管阻塞疾病
B. 視網膜病變
C. 自主神經病變
D. 感覺神經病變

正確答案：B. 視網膜病變